Clinical trial inclusion criterion:
Body mass index (BMI): 18 ≤ BMI ≤ 32 kg/m²

Entity relations:
- Has_value("Body mass index (BMI)", "18 ≤ BMI ≤ 32 kg/m²")